ASA I & II, Nulliparous and Multiparous, Spontaneous/Induced/Augmented Labor, Early active labor (cervix <5 cm (if known)), Pain (VPS) > 3, 18-45 years of age

The above is a clinical trial inclusion criterion. Annotated with entity spans:
[Measurement: ASA] [Value: I & II], [Condition: Nulliparous] and [Condition: Multiparous], [Condition: Spontaneous]/[Procedure: Induced]/[Procedure: Augmented Labor], [Condition: Early active labor] ([Measurement: cervix] [Value: <5 cm] (if known)), [Measurement: Pain (VPS)] [Value: > 3], [Value: 18-45 years] of [Person: age]